Clinical trial exclusion criterion:
Valvular cardiac surgical/percutaneous procedure (i.e., ventriculotomy, atriotomy, and valve repair or replacement and presence of a prosthetic valve)

Annotated entities:
- Procedure: "Valvular cardiac percutaneous procedure"
- Procedure: "Valvular cardiac surgical procedure"
- Procedure: "ventriculotomy"
- Procedure: "atriotomy"
- Procedure: "valve repair"
- Procedure: "valve replacement"
- Device: "prosthetic valve"